Clinical trial exclusion criterion:
Those who have had a transplant.

Annotated entities:
- Procedure: "transplant"